9. Previous myocardial infarction in the distribution of the target vessel for the FFR

The above is a clinical trial exclusion criterion. Annotated with entity spans:
[Parsing_Error: 9.] [Temporal: Previous] [Condition: myocardial infarction] [Qualifier: in the distribution of the target vessel] for the FFR